En un paciente con cirrosis hepática ¿cuál de los siguientes es el procedimiento más útil para medir la respuesta de la ascitis al tratamiento diurético?
1. Medir el volumen de orina de 24 horas.
2. Medir el perímetro abdominal diariamente.
3. Determinar cada semana el gradiente de albúmina entre el suero y la ascitis.
4. Registrar el peso cada día.
5. Evaluar la natriuresis cada 48 horas.

Respuesta correcta: 4. Registrar el peso cada día.